32歲男性病患，過去身體健康良好。此次因為近一日來四肢無力到急診求診。診視時發現病患在病床上意識清醒，呼吸正常，心跳為每分鐘 124次，規則；血壓120/78 mmHg；四肢無法舉離病床，輕觸和疼痛的感覺雙側相同，深部肌腱反射（deep  tendon reflex）下降。實	室檢	發現血鉀為1.5 meq/L；血中 creatine kinase 671 IU/L（參考值，38～174 IU/L）；甲狀腺刺激素（thyroid stimulating hormone）為 0.013 µIU/mL（參考值，0.35～5.5 µIU/mL） 和游離T 4甲狀腺素（free T4 thyroxine）為4.51 ng/dL（參考值，0.89～1.80 ng/dL）。此病患最有可能的診斷為何?
A. 原發性皮質醛酮過多症（primary aldosteronism）
B. 甲狀腺毒性週期性麻痹症（thyrotoxic periodic paralysis）
C. 利尿劑使用過多
D. 第一型及第二型腎小管酸血症（renal tubular acidosis）

正確答案：B. 甲狀腺毒性週期性麻痹症（thyrotoxic periodic paralysis）